Clinical trial exclusion criterion:
(relative) Known contraindications for initiation of eplerenone treatment (hyperkalemia, abnormal renal clearance, severe hepatic insufficiency (Child-Pugh C), type 2 diabetes mellitus with microalbuminuria, concomitant use of potassium supplements, potassium-sparing diuretics, strong CYP3A4 inhibitors, or the combination of an ACE-inhibitor and an angiotensin receptor blocking agent). Pregnancy will not be routinely tested in female patients, but the possibility of pregnancy will be discussed during screening;

Entity relations:
- Has_value("renal clearance", "abnormal")
- Has_value("Child-Pugh", "C")
- AND("contraindications", "eplerenone")
- multi("renal clearance", "abnormal renal clearance")
- Subsumes("severe hepatic insufficiency", "Child-Pugh")
- Has_temporal("potassium supplements", "concomitant")
- OR("hyperkalemia", "renal clearance", "severe hepatic insufficiency", "type 2 diabetes mellitus", "potassium supplements")
- OR("potassium supplements", "potassium-sparing diuretics", "strong CYP3A4 inhibitors", "ACE-inhibitor")